Mutations in which gene cause Schimke immune-osseous dysplasia?

Smarcal1 , also known as harp, is an atp-dependent annealing helicase that stabilizes replication forks during dna damage. Mutations in this gene are the cause of schimke immune-osseous dysplasia , an autosomal recessive disorder characterized by t-cell immunodeficiency and growth dysfunctions.